Clinical trial exclusion criterion:
10. Unexplained, undiagnosed abnormal bleeding per vagina, bleeding per vagina during or following vaginal intercourse, or gynaecologic surgery within 90 days prior to enrollment

Annotated entities:
- Condition: "bleeding per vagina"
- Qualifier: "undiagnosed"
- Qualifier: "Unexplained"
- Qualifier: "abnormal"
- Condition: "bleeding per vagina"
- Temporal: "during vaginal intercourse"
- Temporal: "following vaginal intercourse"
- Procedure: "gynaecologic surgery"
- Temporal: "within 90 days prior to enrollment"
- Reference_point: "enrollment"